Clinical trial exclusion criterion:
Previously enrolled in this study (i.e. patient now at repeat encounter)

Annotated entities:
- Observation: "enrolled in this study"
- Temporal: "Previously"